一位年輕女性因心理無法適應之理由要求終止妊娠，超音波顯示懷孕 5 週，尚無法看到胎兒心跳，她並表明不希望藉由手術方法終止妊娠，下列何者為最適合之終止妊娠之方式？
A. Mifepristone（RU486）
B. Methotrexate
C. Mifepristone（RU486）plus Misoprostol
D. Oxytocin plus Prostaglandin

正確答案：C. Mifepristone（RU486）plus Misoprostol